Clinical trial inclusion criterion:
Provision of informed consent for participation in the study by patient or surrogate (if the patient is unable to provide informed consent) and caregiver

Annotated entities:
- Post-eligibility: "Provision of informed consent for participation in the study by patient or surrogate (if the patient is unable to provide informed consent) and caregiver"